Clinical trial exclusion criterion:
patients with opening of cervical internal os (4 mm of dilatation at the time of consultation);

Annotated entities:
- Observation: "opening of cervical internal os"
- Value: "4 mm of dilatation"